下列何者不供應鼻中隔處的血液？
A. 前篩骨動脈
B. 面動脈分支
C. 蝶腭動脈分支
D. 下唇動脈分支

正確答案：D. 下唇動脈分支